Clinical trial exclusion criterion:
Heterozygous cohorts: Use of prescription medications on a regular basis is not allowed with the following exceptions:

Annotated entities:
- Grammar_Error: "Heterozygous cohorts: Use of prescription medications on a regular basis is not allowed with the following exceptions:"
- Parsing_Error: "Heterozygous cohorts: Use of prescription medications on a regular basis is not allowed with the following exceptions:"